Clinical trial exclusion criterion:
Patients with ongoing infection including HIV and Hepatitis

Annotated entities:
- Condition: "infection"
- Qualifier: "ongoing"
- Condition: "HIV"
- Condition: "Hepatitis"
- Parsing_Error: "and"